Volunteers must not have been vaccinated against HPV-Gardasil-9 (both partners)

The above is a clinical trial exclusion criterion. Annotated with entity spans:
Volunteers must [Negation: not] [Temporal: have been] [Procedure: vaccinated] against [Condition: HPV-Gardasil-9] (both partners)